Clinical trial exclusion criterion:
A glomerular filtration rate of 60 cc per minute or less.

Annotated entities:
- Measurement: "glomerular filtration rate"
- Value: "60 cc per minute or less"